Clinical trial exclusion criterion:
Intelligence quotient (IQ) < 70

Annotated entities:
- Measurement: "Intelligence quotient"
- Measurement: "IQ"
- Value: "< 70"